Clinical trial exclusion criterion:
Patients who have planning for follow-up in another center

Entity relations:
- AND("follow-up", "another center")
- Has_mood("follow-up", "planning for")